Clinical trial inclusion criteria:
1. HIV infection with plasma and CSF HIV RNA concentrations (using Roche Amplicor assay) > 1,000 copies/ mL (available after baseline LP).
2. Off antiretroviral therapy (ART) for > 6 weeks before the study and no plans to begin treatment for the study duration. (The decision of whether or not a subject takes antiretroviral therapy will be made by the subject in consultation with his/her primary care provider prior to screening for this study.)
3. Predicted adherence to the medication.
4. Capable of providing informed consent.
5. > 18 years old
6. CD4 cell counts >150 cells/μL (though likely most, if not all, will be >250 cells/μL).
7. When available, subjects will be screened for stability of blood CD4 and HIV RNA levels.

Annotated entities:
- Condition: "HIV infection"
- Measurement: "plasma concentration"
- Measurement: "CSF HIV RNA concentration"
- Procedure: "Roche Amplicor assay"
- Value: "> 1,000 copies/ mL"
- Procedure: "antiretroviral therapy (ART)"
- Condition: "Off antiretroviral therapy (ART)"
- Temporal: "> 6 weeks before the study"
- Reference_point: "the study"
- Mood: "plans to begin"
- Procedure: "treatment"
- Temporal: "for the study duration"
- Reference_point: "study"
- Negation: "no"
- Context_Error: "treatment"
- Non-representable: "Predicted adherence to the medication."
- Post-eligibility: "Capable of providing informed consent."
- Value: "18 years"
- Person: "old"
- Measurement: "CD4 cell counts"
- Value: ">150 cells/μL"
- Value: ">250 cells/μL"
- Not_a_criteria: "When available, subjects will be screened for stability of blood CD4 and HIV RNA levels."